Clinical trial inclusion criterion:
patients classified with American Society of Anesthesiologists Physical Status Classification System as 1 or 2 status

Annotated entities:
- Measurement: "status American Society of Anesthesiologists Physical Status Classification System"
- Value: "1 or 2"